橫膈（diaphragm）上相對於第十胸椎的裂口是下列何結構？
A. 主動脈裂口（aortic hiatus）
B. 食道裂口（esophageal hiatus）
C. 腔靜脈裂口（caval opening）
D. 奇靜脈裂口（azygal opening）

正確答案：B. 食道裂口（esophageal hiatus）